Clinical trial inclusion criteria:
Prevalent NHHD patients who have received >1 year dialysis with unfractionated heparin as anticoagulant
Age >= 18
Informed consent available

Annotated entities:
- Condition: "NHHD"
- Temporal: ">1 year"
- Procedure: "dialysis"
- Drug: "unfractionated heparin"
- Drug: "anticoagulant"
- Person: "Age"
- Value: ">= 18"
- Non-query-able: "Informed consent available"